Clinical trial exclusion criterion:
no history of significant skin disease such as, but not limited to rash or eruptions, drug allergies, food allergy, dermatitis, eczema, psoriasis, or urticaria

Entity relations:
- Has_qualifier("skin disease", "significant")
- Has_temporal("skin disease", "history")
- Subsumes("skin disease", "rash")
- OR("rash", "psoriasis", "eczema", "dermatitis", "food allergy", "drug allergies", "eruptions", "urticaria")